關於Sturge-Weber syndrome之敘述，下列何者錯誤？
A. 顏面三叉神經支配區皮膚有酒色斑（port-wine stain）
B. 酒色斑是惡性的血管瘤
C. 病患可能併發癲癇
D. 可能出現青光眼

正確答案：B. 酒色斑是惡性的血管瘤